History of gouty arthritis

The above is a clinical trial exclusion criterion. Annotated with entity spans:
History of [Condition: gouty arthritis]